Clinical trial exclusion criterion:
Positive urine toxicology screen for substances of non-therapeutic use prior to craving assessments

Entity relations:
- Has_qualifier("urine toxicology screen", "substances of non-therapeutic use")
- Has_value("urine toxicology screen", "Positive")
- Has_index("prior to craving assessments", "craving assessments")
- Has_temporal("urine toxicology screen", "prior to craving assessments")